History of seizures (this criterion does not apply to subjects who have had a single, uncomplicated febrile convulsion in the past) or neurological disease.

The above is a clinical trial exclusion criterion. Annotated with entity spans:
[Temporal: History] of [Condition: seizures] (this criterion [Negation: does not apply] to subjects who have had a [Multiplier: single], [Qualifier: uncomplicated] [Condition: febrile convulsion] in the past) or [Condition: neurological disease].